一位45歲男性病人有慢性C型肝炎病史，因尿中泡沫多及水腫且體重增加5公斤而來求診，其24小時尿蛋白流 4 g/dL，血中補體（complement）濃度下降，下列敘述何者錯誤？
A. 其蛋白尿程度已達腎病症候群之標準
B. 病人血液中常出現冷凝蛋白（cryoglobulin）
C. 較易出現腎動脈栓塞
D. 若做腎臟穿刺，病理診斷最可能是MPGN（membranoproliferative glomerulonephritis）

正確答案：C. 較易出現腎動脈栓塞